Clinical trial exclusion criterion:
A history of penetrating ocular trauma in the study eye.

Entity relations:
- Has_qualifier("penetrating ocular trauma", "in the study eye")
- Has_temporal("penetrating ocular trauma", "history of")